Clinical trial exclusion criterion:
Psychiatric disorders other than insomnia, PTSD and specific phobias; including bipolar and psychotic disorders and meeting criteria for DSM-5 moderate alcohol or drug use disorders within the past year.

Entity relations:
- Subsumes("Psychiatric disorders", "bipolar")
- Has_negation("insomnia", "other")
- Has_qualifier("alcohol use disorders", "moderate")
- Has_qualifier("alcohol use disorders", "DSM-5")
- Has_temporal("alcohol use disorders", "past year")
- OR("bipolar", "psychotic disorders")
- OR("insomnia", "PTSD", "phobias")
- OR("alcohol use disorders", "drug use disorders")